下列各年齡層，那一個年齡層，生理及社會層面上，個體間差異性最大？
A. 孩童
B. 青少年
C. 中年
D. 老年

正確答案：D. 老年